Clinical trial exclusion criterion:
Barrier methods of contraception: Condom or Occlusive cap diaphragm or cervical/vault caps) with spermicidal foam/gel/film/cream/vaginal suppository In case of use of oral contraception women should have been stable on the same pill for a minimum of 3 months before taking study treatment

Annotated entities:
- Procedure: "contraception"
- Device: "Condom"
- Device: "Occlusive cap diaphragm"
- Device: "vault caps"
- Device: "cervical caps"
- Procedure: "spermicidal foam"
- Non-query-able: "Barrier methods of contraception: Condom or Occlusive cap diaphragm or cervical/vault caps) with spermicidal foam/gel/film/cream/vaginal suppository In case of use of oral contraception women should have been stable on the same pill for a minimum of 3 months before taking study treatment"